Clinical trial exclusion criterion:
myopia of > or = to 8 diopters.

Annotated entities:
- Condition: "myopia"
- Value: "> or = to 8 diopters"